Clinical trial exclusion criterion:
Linguistic barrier or psychological profile preventing the patient from signing the consent form.

Annotated entities:
- Observation: "Linguistic barrier"
- Condition: "psychological profile"
- Negation: "preventing"
- Informed_consent: "signing the consent form"